Clinical trial exclusion criterion:
History or renal transplantation

Annotated entities:
- Measurement: "renal transplantation"
- Temporal: "History"